病例對照研究中，下列何種疾病比較適合使用累積抽樣（cumulative sampling）來選取病例與對照組？
A. 糖尿病
B. 癌症
C. 腦中風
D. 食物中毒

正確答案：D. 食物中毒